emergency operation

The above is a clinical trial exclusion criterion. Annotated with entity spans:
[Qualifier: emergency] [Procedure: operation]